Clinical trial exclusion criterion:
Diabetic gastroparesis

Annotated entities:
- Condition: "Diabetic gastroparesis"